Patient meets protocol criteria for diagnosis of IBS-C, abdominal pain, abdominal bloating and abdominal girth

The above is a clinical trial inclusion criterion. Annotated with entity spans:
Patient meets [Qualifier: protocol criteria] for diagnosis of [Condition: IBS-C], [Condition: abdominal pain], [Condition: abdominal bloating] and [Condition: abdominal girth]